ECOG PS: 0,1

The above is a clinical trial inclusion criterion. Annotated with entity spans:
[Measurement: ECOG PS]: [Value: 0,1]